La sobrecarga de volumen del ventrículo izquierdo aparece en:
1. Las estenosis de las válvulas cardiacas.
2. La coartación de la aorta.
3. La angina de reposo.
4. Las insuficiencias de las válvulas cardiacas.
5. La fiebre reumática.

Respuesta correcta: 4. Las insuficiencias de las válvulas cardiacas.